La pentostatina es un inhibidor de la enzima adenosina desaminasa. ¿Cómo es su mecanismo de inhibición?
1. Es un inhibidor suicida.
2. Es un inhibidor alostérico.
3. Es un inhibidor análogo del estado de transición.
4. Es un inhibidor irreversible covalente.

Respuesta correcta: 3. Es un inhibidor análogo del estado de transición.